42 歲女性病人，前頸部吞嚥異物感 2 年，沒有心悸或怕熱等症狀，無咳嗽，頸部中央靠近喉結下有一腫塊，近一星期左右增大約 2 公分，微痛，身體檢查觸診微軟有彈性，無壓痛，無淋巴腺腫大。 該腫塊位於甲狀軟骨前下方，並有吞嚥時位移及抬舌位移現象，下列何者是最正確的診斷？
A. 淋巴瘤（lymphoma）
B. 甲狀腺囊腫（thyroid cyst）
C. 甲狀舌骨囊腫（thyroglossal cyst）
D. 食道腫瘤（esophageal tumor）

正確答案：C. 甲狀舌骨囊腫（thyroglossal cyst）